乳房攝影檢查時，腫瘤或鈣化之影像因年齡增加而有所改變，下列敘述何者正確？
A. 脂肪減少，影像清晰
B. 脂肪增加，影像模糊
C. 脂肪減少，影像模糊
D. 脂肪增加，影像清晰

正確答案：D. 脂肪增加，影像清晰